Clinical trial exclusion criterion:
Drug or alcohol dependence within 1 year

Entity relations:
- Has_temporal("Drug dependence", "within 1 year")
- OR("Drug dependence", "alcohol dependence")